Any history of meningococcal vaccination or meningococcal and gonorrhoea diseases.

The above is a clinical trial exclusion criterion. Annotated with entity spans:
Any [Temporal: history] of [Drug: meningococcal vaccination] or [Condition: meningococcal] and [Condition: gonorrhoea diseases].